Clinical trial inclusion criterion:
3. Histologically confirmed squamous cell bronchogenic carcinoma. Patients whose tumors contain mixed non-small cell histologies are eligible, as long as squamous carcinoma is the predominant histology. Mixed tumors with small cell anaplastic elements are not eligible. Cytologic specimens obtained by brushings, washings, or needle aspiration of the defined lesion are acceptable.

Annotated entities:
- Condition: "squamous cell bronchogenic carcinoma"
- Procedure: "Histologically"
- Value: "confirmed"
- Condition: "mixed non-small cell histologies"
- Condition: "squamous carcinoma"
- Qualifier: "predominant histology"
- Observation: "small cell anaplastic elements"
- Negation: "not"
- Condition: "Mixed tumors"
- Qualifier: "small cell anaplastic elements"